Any known history of hypersensitivity to interferon.

The above is a clinical trial exclusion criterion. Annotated with entity spans:
Any known history of [Condition: hypersensitivity] to [Drug: interferon].